Patients with clinically significant cardiovascular, renal, hepatic, endocrine disease, cancer or diabetes

The above is a clinical trial exclusion criterion. Annotated with entity spans:
Patients with clinically [Qualifier: significant] [Condition: cardiovascular], [Condition: renal], [Condition: hepatic], [Condition: endocrine disease], [Condition: cancer] or [Condition: diabetes]